What is the basis of the BLISS technique?

BLISS is a versatile and quantitative method for genome-wide profiling of DNA double-strand breaks.  A recent method, BLISS, uses photoreactive nucleotides to crosslink RBPs to target RNAs in cells prior to immunoprecipitation.